下列何種酵素反應不參與 DNA 聚合酶（polymerase）的校對（proofreading）功能？
A. 3'→5'外切酶（exonuclease）的活性
B. 磷酸二酯鍵（phosphodiester bond）的水解
C. 鹼基配對錯誤（mismatched base pairs）
D. 5'→3'外切酶（exonuclease）的活性

正確答案：D. 5'→3'外切酶（exonuclease）的活性